Clinical trial exclusion criteria:
having experienced severe allergies, trauma history and/or operation history within 3 months.
with a history of mental illness and/or family history of mental illness limb disabled.
taking medicine within one month.
suffering major events or having mood swings.
having internal and surgical disease(after having variety of physical examination such as electrocardiogram/hepatic and renal function/blood routine and urine routine)
chromosome aberrations in anyone of the couple.
patients who have drugs contraindications

Annotated entities:
- Qualifier: "severe"
- Condition: "allergies"
- Condition: "trauma"
- Temporal: "history"
- Procedure: "operation"
- Temporal: "history"
- Temporal: "within 3 months"
- Condition: "mental illness"
- Temporal: "history"
- Observation: "family history"
- Condition: "mental illness"
- Qualifier: "limb disabled"
- Drug: "medicine"
- Qualifier: "within one month"
- Condition: "major events"
- Condition: "mood swings"
- Condition: "surgical disease"
- Procedure: "surgical"
- Condition: "internal disease"
- Procedure: "physical examination"
- Procedure: "electrocardiogram"
- Procedure: "hepatic function"
- Procedure: "renal function"
- Procedure: "blood routine"
- Procedure: "urine routine"
- Temporal: "after having variety of physical examination such as electrocardiogram/hepatic and renal function/blood routine and urine routine"
- Reference_point: "having variety of physical examination such as electrocardiogram/hepatic and renal function/blood routine and urine routine"
- Condition: "chromosome aberrations"
- Observation: "anyone of the couple"
- Qualifier: "anyone of the couple"
- Drug: "drugs"
- Condition: "contraindications"